Clinical trial exclusion criterion:
Active CNS or epiduraltumor

Annotated entities:
- Condition: "CNS tumor"
- Condition: "epiduraltumor"